Ongoing serious bacterial infections at the time of screening.

The above is a clinical trial exclusion criterion. Annotated with entity spans:
Ongoing [Qualifier: serious] [Condition: bacterial infections] [Temporal: at the time of screening].